Provision of signed and dated, written informed consent prior to any study specific procedures, sampling and analyses.

The above is a clinical trial inclusion criterion. Annotated with entity spans:
[Post-eligibility: Provision of signed and dated, written informed consent prior to any study specific procedures, sampling and analyses.]